百日咳桿菌（Bordetella pertussis）會產生百日咳毒素（pertussis toxin），催化 Giα（即 inhibitory G 蛋白α次單元）之 ADP-ribosylation，導致 adenylate cyclase 的持續性活化。下列有關 pertussis toxin 致病機轉之敘述，何者正確？
A. pertussis toxin 抑制 Giα由 GDP 結合態到 GTP 結合態的轉換
B. pertussis toxin 抑制 Giα由 GTP 結合態到 GDP 結合態的轉換
C. pertussis toxin 抑制 Giα的 GTPase 活性
D. pertussis toxin 促進 Giα對 adenylate cyclase 的作用

正確答案：A. pertussis toxin 抑制 Giα由 GDP 結合態到 GTP 結合態的轉換